Eastern Cooperative Oncology Group (ECOG) performance status of 0, 1 or 2.

The above is a clinical trial inclusion criterion. Annotated with entity spans:
[Measurement: Eastern Cooperative Oncology Group (ECOG) performance status] of [Value: 0, 1 or 2].